Un paciente acude a urgencias con quemaduras en periné y miembro inferior derecho anterior y posterior. ¿Qué porcentaje de superficie corporal tiene quemada según el método Wallace?:
1. 17%.
2. 18%.
3. 19%.
4. 20%.

Respuesta correcta: 3. 19%.